Clinical trial inclusion criterion:
treated hypertension

Entity relations:
- Has_qualifier("hypertension", "treated")